下列何者與尾畸胎瘤（sacrococcygeal teratoma）的形成有關？
A. 脊索（notochord）的存留
B. 原條（primitive streak）的殘存
C. 脊索前板（prechordal plate）的發育
D. 胚外中胚層的增生

正確答案：B. 原條（primitive streak）的殘存